Patient with Social Security

The above is a clinical trial inclusion criterion. Annotated with entity spans:
[Non-query-able: Patient with Social Security]